A history of substance abuse and/or dependence.

The above is a clinical trial exclusion criterion. Annotated with entity spans:
A history of [Condition: substance abuse] and/or dependence.